Clinical trial exclusion criterion:
Acute coronary syndrome (ACS) within 3 months.

Entity relations:
- Subsumes("Acute coronary syndrome", "ACS")
- Has_temporal("Acute coronary syndrome", "within 3 months")